造成胎兒心跳變異性減速（variable decelerations）的主要原因為何？
A. 胎頭壓迫
B. 母親酸血症
C. 臍帶壓迫阻塞
D. 胎兒缺氧

正確答案：C. 臍帶壓迫阻塞